Clinical trial exclusion criterion:
Unwillingness to tolerate menstrual irregularity

Entity relations:
- Has_mood("menstrual irregularity", "Unwillingness to tolerate")